Has a history of (non-infectious) pneumonitis that required steroids or current pneumonitis

The above is a clinical trial exclusion criterion. Annotated with entity spans:
Has a [Temporal: history] of ([Condition: non-infectious) pneumonitis] that required [Drug: steroids] or [Temporal: current] [Drug: pneumonitis]